the resected lesion must have been well differentiated and confined to the mucosa (m2 maximum) on histological analysis,

The above is a clinical trial inclusion criterion. Annotated with entity spans:
the [Condition: resected lesion] must have been [Qualifier: well differentiated] and [Qualifier: confined to the mucosa] ([Qualifier: m2 maximum]) on [Procedure: histological analysis],